Clinical trial exclusion criterion:
Administration of immunoglobulins and/or any blood products within the three months preceding the first vaccination or during the study.

Annotated entities:
- Drug: "immunoglobulins"
- Drug: "any blood products"
- Temporal: "within the three months preceding the first vaccination"
- Temporal: "during the study"
- Reference_point: "the first vaccination"
- Procedure: "vaccination"
- Temporal: "first"
- Reference_point: "the study"